Clinical trial inclusion criterion:
Singleton fetus

Annotated entities:
- Condition: "Singleton fetus"